Clinical trial exclusion criterion:
Periodontal sites that presented bleeding during crevicular fluid collection or sites that prevent proper collection of clinical parameters.

Annotated entities:
- Non-representable: "Periodontal sites that presented bleeding during crevicular fluid collection or sites that prevent proper collection of clinical parameters."